Clinical trial exclusion criterion:
Extracranial active bleeding

Annotated entities:
- Condition: "Extracranial bleeding"
- Qualifier: "active"